依照2012年最新之KDIGO（Kidney Disease：Improving Global Outcomes）準則，下列診斷急性腎損傷 （acute kidney injury）之定義何者錯誤？
A. 血清肌酸酐值於48小時內上升幅度大於或等於0.3 mg/dL
B. 血清肌酸酐值於5天內上升幅度大於或等於25%
C. 血清肌酸酐值於一星期內上升幅度大於或等於50%
D. 尿液每小時之排出量少於0.5 mL/kg，並持續6小時

正確答案：B. 血清肌酸酐值於5天內上升幅度大於或等於25%